Patient refusal to provide informed consent.

The above is a clinical trial exclusion criterion. Annotated with entity spans:
[Post-eligibility: Patient refusal to provide informed consent].